Concomitant treatment with any other anticancer therapy.

The above is a clinical trial exclusion criterion. Annotated with entity spans:
[Temporal: Concomitant] [Procedure: treatment] with [Qualifier: any other] [Procedure: anticancer therapy].